Patients that do not have a valid Ontario Health Insurance Plan (OHIP) number at time of first transfusion

The above is a clinical trial exclusion criterion. Annotated with entity spans:
Patients that do [Negation: not] [Mood: have a valid Ontario Health Insurance Plan (OHIP) number] [Temporal: at time of first transfusion]